Clinical trial exclusion criterion:
Significant renal or hepatic disease as evidenced by a serum creatinine greater than 1.5× upper limit of normal (ULN), serum transaminases greater than 3× ULN, or total bilirubin greater than 1.5× ULN in absence of Gilbert's syndrome

Annotated entities:
- Qualifier: "Significant"
- Condition: "hepatic disease"
- Condition: "renal disease"
- Measurement: "serum creatinine"
- Value: "greater than 1.5× upper limit of normal (ULN)"
- Measurement: "serum transaminases"
- Value: "greater than 3× ULN"
- Measurement: "total bilirubin"
- Value: "greater than 1.5× ULN"
- Negation: "absence of"
- Condition: "Gilbert's syndrome"